Suspected or known gynecological malignancy.

The above is a clinical trial exclusion criterion. Annotated with entity spans:
[Mood: Suspected] or [Mood: known] [Condition: gynecological malignancy].